Clinical trial inclusion criterion:
Patients 18 years of age or older with >3 unformed stools/24 hours with positive stool test for C. difficile.

Annotated entities:
- Person: "age"
- Value: "or older 18 years"
- Multiplier: ">3"
- Observation: "unformed stools"
- Temporal: "24 hours"
- Measurement: "stool test"
- Value: "positive"
- Qualifier: "C. difficile"